Indique cuál de las siguientes alteraciones del metabolismo puede cursar con gota:
1. Metabolismo de las porfirinas.
2. Metabolismo de los aminoácidos ácidos.
3. Metabolismo de los aminoácidos básicos.
4. Metabolismo del glucógeno.
5. Metabolismo de las purinas.

Respuesta correcta: 5. Metabolismo de las purinas.